Clinical trial exclusion criterion:
severe liver dysfunction (Child-Pugh Score C)

Entity relations:
- Has_qualifier("liver dysfunction", "severe")
- Has_value("Child-Pugh Score", "C")
- Subsumes("severe", "Child-Pugh Score")